Clinical trial inclusion criterion:
Liver cirrhosis

Annotated entities:
- Condition: "Liver cirrhosis"